Intake of medicines listed in the section 'Prohibited concomitant treatment' for 1 month prior to the enrollment in the trial.

The above is a clinical trial exclusion criterion. Annotated with entity spans:
Intake of [Drug: medicines] [Qualifier: listed in the section 'Prohibited concomitant treatment'] for [Temporal: 1 month prior to the enrollment in the trial].